Parents able to provide written informed consent and adolescents must additionally provide assent.

The above is a clinical trial inclusion criterion. Annotated with entity spans:
[Person: Parents] able to [Observation: provide written informed consent] and [Person: adolescents] must additionally [Observation: provide assent].